Clinical trial inclusion criterion:
Subject are able to complete study procedures, such as spirometry, and Pulmonary Exercise test.

Entity relations:
- Subsumes("study procedures", "Pulmonary Exercise test")
- Subsumes("study procedures", "spirometry")